Clinical trial exclusion criterion:
NSAID use within the past 48 hours

Entity relations:
- Has_temporal("NSAID", "within the past 48 hours")